Clinical trial exclusion criterion:
Liver cirrhosis (Child-Pugh all stages)

Entity relations:
- Has_value("Child-Pugh", "all stages")
- AND("Liver cirrhosis", "Child-Pugh")